Clinical trial inclusion criterion:
3. Willingness to follow recommendations.

Annotated entities:
- Post-eligibility: "Willingness to follow recommendations."